Clinical trial exclusion criterion:
The patient is pregnant or breastfeeding

Annotated entities:
- Condition: "pregnant"
- Observation: "breastfeeding"